no female subject of childbearing potential without use of effective nonhormonal birth control methods, or not willing to continue practicing these birth control methods for at least 30 days after the end of the treatment period

The above is a clinical trial exclusion criterion. Annotated with entity spans:
no [Person: female] subject of [Condition: childbearing potential] [Negation: without] use of [Qualifier: effective] [Procedure: nonhormonal birth control] methods, or [Negation: not] [Mood: willing to continue practicing] these [Procedure: birth control methods] [Temporal: for at least 30 days after the end of the treatment period]